Clinical trial exclusion criterion:
Patients with any panel reactive antibody (PRA) equal to or above 50%, class I or class II;

Entity relations:
- Subsumes("panel reactive antibody", "PRA")
- Has_value("panel reactive antibody", "equal to or above 50%")
- OR("equal to or above 50%", "class I", "class II")